下列那一種疾病最常發生遠端指間關節（distal interphalangeal joint）發炎或病變？
A. 血友病出血性關節病變（hemoarthropathy）
B. 乾癬性關節炎（psoriatic arthritis）
C. 類風濕性關節炎（rheumatoid arthritis）
D. 風濕性關節炎（rheumatic arthritis）

正確答案：B. 乾癬性關節炎（psoriatic arthritis）